Clinical trial exclusion criterion:
Treatment site has active skin lesion or inflammation

Entity relations:
- Has_qualifier("skin lesion", "active")
- OR("skin lesion", "inflammation")